What is the Bartter syndrome?

Bartter syndrome is a syndrome associated with congenital tubular dysfunction, characterized by hypokalemia and metabolic alkalosis